膽小管（bile canaliculi）是藉由下列那些細胞間的接合複體（junctional complex）形成？
A. 肝細胞與肝細胞
B. 肝細胞與內皮細胞
C. 伊藤細胞與內皮細胞
D. 內皮細胞與內皮細胞

正確答案：A. 肝細胞與肝細胞